Clinical trial inclusion criterion:
Age: >=40 and <=80 years of age at Screening (Visit 1).

Entity relations:
- Has_value("age", ">=40 and <=80 years")
- Has_value("Age", ">=40 and <=80 years")
- Has_index("at Screening", "Screening")
- Has_temporal("age", "at Screening")
- Has_temporal("Age", "at Screening")
- OR("Age", "age")